Clinical trial exclusion criterion:
Pregnant or breastfeeding women

Annotated entities:
- Condition: "Pregnant"
- Condition: "breastfeeding"
- Person: "women"